heart failure NYHA II-IV

The above is a clinical trial inclusion criterion. Annotated with entity spans:
[Condition: heart failure] [Measurement: NYHA] [Value: II-IV]